Clinical trial inclusion criterion:
Medically stable

Annotated entities:
- Condition: "stable"
- Qualifier: "Medically"